Clinical trial inclusion criterion:
IQ greater than or equal to 70

Entity relations:
- Has_value("IQ", "greater than or equal to 70")